without evidence of distant metastases.

The above is a clinical trial inclusion criterion. Annotated with entity spans:
[Negation: without] [Mood: evidence] of [Condition: distant metastases].